Clinical trial inclusion criterion:
Histologically confirmed PD-L1 status defined NSCLC. Biopsy must be within 70 days of first treatment with pembrolizumab.

Entity relations:
- Has_qualifier("NSCLC", "PD-L1 status")
- Has_temporal("Biopsy", "within 70 days of first treatment")
- Has_index("within 70 days of first treatment", "first treatment with pembrolizumab")